Clinical trial inclusion criterion:
suspicion of nonfunctional P-NET on primary CT (i.e hypervascularity) or MRI

Entity relations:
- Has_mood("nonfunctional P-NET", "suspicion")
- AND("nonfunctional P-NET", "primary CT")
- Subsumes("primary CT", "hypervascularity")
- OR("primary CT", "MRI")